Surgical patients 60 years of age or older

The above is a clinical trial inclusion criterion. Annotated with entity spans:
Surgical patients [Value: 60 years] of [Person: age] or older